Clinical trial exclusion criterion:
Current use of systemic corticosteroids in the 3 months prior this study.

Entity relations:
- Has_temporal("systemic corticosteroids", "Current")
- Has_temporal("systemic corticosteroids", "in the 3 months prior this study")